Clinical trial exclusion criterion:
Antibiotic prophylaxis within the last 6 months

Entity relations:
- multi("Antibiotic prophylaxis", "Antibiotic")
- Has_temporal("Antibiotic prophylaxis", "within the last 6 months")